Current use of a psychotropic nutraceutical (e.g. St John's wort)

The above is a clinical trial inclusion criterion. Annotated with entity spans:
[Temporal: Current] [Procedure: use] of a [Drug: psychotropic nutraceutical] (e.g. [Condition: St John's wort])